Clinical trial exclusion criterion:
Subjects who previously enrolled in this study

Annotated entities:
- Context_Error: "Subjects who previously enrolled in this study"
- Post-eligibility: "Subjects who previously enrolled in this study"